Clinical trial exclusion criteria:
Women with Non-proteinuric hypertension
severe renal impairment
Myasthenia gravis
High amount of magnesium in blood
Low or high amount of calcium in blood
Myocardial damage, diabetic coma, heart block

Annotated entities:
- Condition: "Non-proteinuric hypertension"
- Person: "Women"
- Qualifier: "severe"
- Condition: "renal impairment"
- Condition: "Myasthenia gravis"
- Value: "High amount"
- Measurement: "magnesium in blood"
- Value: "Low amount"
- Value: "high amount"
- Measurement: "calcium in blood"
- Condition: "Myocardial damage"
- Condition: "diabetic coma"
- Condition: "heart block"